En una nube de puntos observamos que los datos están alineados en una recta decreciente. Cuál de los siguientes valores del coeficiente de correlación de Pearson es el más apropiado para una situación de ese tipo:
1. r = -2.
2. r = -1.
3. r = 0.
4. r = 1.

Respuesta correcta: 2. r = -1.